Clinical trial inclusion criterion:
aspartate aminotransferase/alanine aminotransferase within 2 times the upper limit of normal range

Annotated entities:
- Measurement: "alanine aminotransferase"
- Measurement: "aspartate aminotransferase"
- Value: "within 2 times the upper limit of normal range"